Subject has pulmonary vein stent.

The above is a clinical trial exclusion criterion. Annotated with entity spans:
Subject has [Device: pulmonary vein stent].